Clinical trial inclusion criterion:
7. Are taking megestrol acetate and continue to lose weight despite at least 2 weeks of therapy.

Entity relations:
- Has_temporal("lose weight", "continue")
- Has_temporal("therapy", "at least 2 weeks")
- AND("lose weight", "therapy")
- Has_temporal("megestrol acetate", "Are taking")